¿A qué se refiere el muestreo intersesional utilizado en las técnicas de observación:
1. Al registro de la información relevante entre sesiones.
2. A la periodicidad, número y criterios de inicio-fin de las sesiones.
3. A las rondas sucesivas de observación de los sujetos a observar.
4. A la selección temporal y su modalidad de intervalo o parcial.
5. Al registro de eventos focales que ocurren entre sesiones.

Respuesta correcta: 2. A la periodicidad, número y criterios de inicio-fin de las sesiones.